Male and female subjects aged 9 to 17 months on the day of inclusion

The above is a clinical trial inclusion criterion. Annotated with entity spans:
[Person: Male] [Grammar_Error: and] [Person: female] subjects [Person: aged] [Value: 9 to 17 months] [Temporal: on the day of inclusion]